Age: 60-85 years, right-handed;

The above is a clinical trial inclusion criterion. Annotated with entity spans:
[Person: Age]: [Value: 60-85 years], [Observation: right-handed];